Describe the Java Adverse Drug Event (JADE) tool

The Java Adverse Drug Event (JADE) tool enables the analysis of prescribed drugs in connection with diagnoses from hospital stays. It can support physicians during their planning of clinical trials by showing the occurrences of adverse drug events with population based information.